What is the use of the ATRIA score?

ATRIA score determines bleeding risk for patients on warfarin.